Moderate or severe claudication (Rutherford category 2 or 3)

The above is a clinical trial inclusion criterion. Annotated with entity spans:
[Qualifier: Moderate] or [Qualifier: severe] [Condition: claudication] ([Measurement: Rutherford category] [Value: 2 or 3])